Si se quisiera estudiar la eficacia y seguridad de un nuevo citostático para un determinado proceso oncológico y, al mismo tiempo, contrastar la eficacia que añade a dicho tratamiento un nuevo anticuerpo monoclonal, ¿cuál sería el diseño de estudio más apropiado?
1. Ensayo paralelo.
2. Ensayo cruzado.
3. Ensayo factorial.
4. Ensayo secuencial.
5. Ensayo de n = 1.

Respuesta correcta: 3. Ensayo factorial.